Clinical trial exclusion criterion:
6. Other diseases or conditions, for which the doctor of the patients do not agree his or her participating.

Annotated entities:
- Condition: "Other diseases"
- Condition: "Other conditions"
- Undefined_semantics: "Other diseases or conditions"
- Subjective_judgement: "for which the doctor of the patients do not agree his or her participating."
- Qualifier: "for which the doctor of the patients do not agree his or her participating"
- Non-query-able: "Other diseases or conditions, for which the doctor of the patients do not agree his or her participating."